Clinical trial exclusion criterion:
severe hypotension, shock, including cardiogenic shock

Annotated entities:
- Condition: "hypotension"
- Condition: "shock"
- Condition: "cardiogenic shock"
- Qualifier: "severe"